野生小兒麻痺病毒株已近乎絕跡，陳醫師發現疑似案例，下列何種實驗方法最能夠確定其為小兒麻痺野生株或沙賓口服疫苗株？
A. 紅血球凝集試驗
B. 溶菌斑實驗
C. 基因定序
D. 單株抗體中和反應

正確答案：C. 基因定序